Clinical trial inclusion criterion:
Symptomatic or asymptomatic metastatic breast cancer.

Annotated entities:
- Condition: "metastatic breast cancer"
- Qualifier: "asymptomatic"
- Qualifier: "Symptomatic"